Clinical trial exclusion criterion:
cervicitis

Annotated entities:
- Condition: "cervicitis"